an underlying infectious disease

The above is a clinical trial exclusion criterion. Annotated with entity spans:
an [Qualifier: underlying] [Condition: infectious disease]